一位 25 歲女性，於七年前小腿出現多處疼痛的紅色結節，而在二年前開始於陰唇部位出現劇痛性潰瘍，患者也經常出現口腔潰瘍，曾因虹彩炎（uveitis）在眼科就診。這位患者最有可能之診斷為何？
A. 疤痕性類天疱瘡（cicatricial pemphigoid）
B. 克隆氏病（Crohn's disease）
C. 貝塞特氏病（Behçet's disease）
D. 多形性紅斑（erythema multiforme）

正確答案：C. 貝塞特氏病（Behçet's disease）